Fructose intolerance, glucose-galactose malabsorption or sucrose-isomaltase insufficiency.

The above is a clinical trial exclusion criterion. Annotated with entity spans:
[Condition: Fructose intolerance], [Condition: glucose-galactose malabsorption] or [Condition: sucrose-isomaltase insufficiency].